Clinical trial inclusion criterion:
Can provide informed consent form expressing willingness to participate in the study and comply with follow-up tests and evaluation procedures.

Annotated entities:
- Post-eligibility: "Can provide informed consent form expressing willingness to participate in the study and comply with follow-up tests and evaluation procedures."